Clinical trial inclusion criterion:
NIHSS: 4-25;

Annotated entities:
- Measurement: "NIHSS"
- Value: "4-25"